Clinical trial exclusion criterion:
Serum creatinine level >120 umol/ml for men and >105 umol/ml for women at screening.

Entity relations:
- Has_value("women", ">105 umol/ml")
- Has_value("men", ">120 umol/ml")
- AND("Serum creatinine level", "men")
- Has_temporal("Serum creatinine level", "at screening")
- AND("Serum creatinine level", "women")